Clinical trial inclusion criterion:
Pathologic confirmation of lung adenocarcinoma with measurable disease, defined as at least one lesion that can be accurately measured in at least one dimension (longest diameter to be recorded on CT); Patients must have previously untreated locally advanced or metastatic NSCLC; Patients must have lung cancer with a documented EGFR activating mutation (exon 19 deletion, L858R).

Annotated entities:
- Condition: "lung adenocarcinoma"
- Procedure: "Pathologic"
- Value: "confirmation"
- Qualifier: "with measurable disease"
- Multiplier: "at least one"
- Condition: "lesion"
- Qualifier: "can be accurately measured in at least one dimension"
- Qualifier: "untreated"
- Qualifier: "locally advanced"
- Qualifier: "metastatic"
- Condition: "NSCLC"
- Condition: "lung cancer"
- Qualifier: "with EGFR activating mutation"
- Condition: "exon 19 deletion"
- Condition: "L858R"
- Line: "Pathologic confirmation of lung adenocarcinoma with measurable disease, defined as at least one lesion that can be accurately measured in at least one dimension (longest diameter to be recorded on CT)"
- Line: "Patients must have previously untreated locally advanced or metastatic NSCLC"
- Line: "Patients must have lung cancer with a documented EGFR activating mutation (exon 19 deletion, L858R)."